Clinical trial exclusion criterion:
Positive alcohol (breath test) or nicotine screen at Screening Visit or Day 1 (positive nicotine screen does not apply to heterozygous cohort).

Annotated entities:
- Measurement: "breath test"
- Measurement: "alcohol test"
- Value: "Positive"
- Measurement: "nicotine screen"
- Temporal: "at Screening Visit"
- Reference_point: "Screening Visit"